Clinical trial inclusion criterion:
11. Willing to answer acceptability and adherence questionnaires throughout the study

Entity relations:
- Has_mood("adherence questionnaires", "Willing")
- Has_temporal("adherence questionnaires", "throughout the study")
- Has_mood("acceptability questionnaires", "Willing")
- Has_temporal("acceptability questionnaires", "throughout the study")